Clinical trial exclusion criterion:
patient belonging to another health sector in the Community of Madrid or other community

Annotated entities:
- Non-query-able: "patient belonging to another health sector in the Community of Madrid or other community"